Clinical trial inclusion criterion:
Born, raised and currently living at low altitude (<800m).

Annotated entities:
- Observation: "living at low altitude"
- Observation: "living at <800m"